Recent (2-year) history or evidence of alcoholism or drug abuse

The above is a clinical trial exclusion criterion. Annotated with entity spans:
[Temporal: Recent] ([Temporal: 2-year]) [Temporal: history] or [Mood: evidence] of [Condition: alcoholism] or [Condition: drug abuse]